Clinical trial exclusion criterion:
Any fracture in the leg to be measured within 6 months prior to the screening visit.

Entity relations:
- Has_index("within 6 months prior to the screening visit", "the screening visit")
- Has_temporal("fracture in the leg", "within 6 months prior to the screening visit")